小明平常偶爾吃一點花生後就會很不舒服，有一天不小心吃了以花生油炸過的芝麻球，幾分鐘後就喘不過氣來。小明體內對花生也有特異性的 T 細胞活性，最可能是那一種？
A. T 輔助細胞第一型（Th1 cells）
B. T 輔助細胞第二型（Th2 cells）
C. T 調節細胞（Treg cells）
D. T 毒殺細胞（Tc cells）

正確答案：B. T 輔助細胞第二型（Th2 cells）